白色念珠菌（Candida albicans）可引起的感染不包括下列那一項？
A. 黏膜感染
B. 皮膚感染
C. 產毒性感染
D. 臟器感染

正確答案：C. 產毒性感染